神經傳遞物質的釋放過程與下列何離子有關？
A. 鎂
B. 鈣
C. 鈉
D. 鉀

正確答案：B. 鈣